Complications to RYGB. Documented reactive hypoglycaemia, severe dumping (vomiting, diarrhea, severe abdominal pain after food intake).

The above is a clinical trial exclusion criterion. Annotated with entity spans:
[Condition: Complications] to [Procedure: RYGB]. Documented [Condition: reactive hypoglycaemia], [Qualifier: severe] [Condition: dumping] ([Condition: vomiting], [Condition: diarrhea], [Qualifier: severe] [Condition: abdominal pain] [Temporal: after food intake]).